下列何者位於輸卵管的外側？
A. 懸韌帶
B. 樞紐韌帶
C. 卵巢韌帶
D. 子宮圓韌帶

正確答案：A. 懸韌帶